有關氣喘（bronchial asthma）的敘述，下列何者正確？
A. 吸入型類固醇（inhaled corticosteroid）的廣泛使用是近年來氣喘病患死亡率減少的主因之一
B. 氣喘（bronchial asthma）的定義（definition）很容易達成共識，診斷也容易與其他疾病區隔分開
C. 氣喘（bronchial asthma）病患的氣道黏膜（airway mucosa）發炎，主要是有白血球（neutrophils），B淋
D. 氣喘控制不良（poor control of bronchial asthma）的最主要原因是短效支氣管擴張劑（bronchodilators）不規則使用

正確答案：A. 吸入型類固醇（inhaled corticosteroid）的廣泛使用是近年來氣喘病患死亡率減少的主因之一